Clinical trial inclusion criteria:
Children with clinical diagnosis of PWS;
Age range: 7 to 14 years-old;
Voluntarily participated and Written informed consent signed

Annotated entities:
- Person: "Children"
- Qualifier: "clinical diagnosis"
- Condition: "PWS"
- Person: "Age"
- Value: "7 to 14 years-old"
- Observation: "Written informed consent signed"
- Observation: "Voluntarily participated"